Ocular allergy

The above is a clinical trial exclusion criterion. Annotated with entity spans:
[Condition: Ocular allergy]